Patients that are considered ineligible for this study by the investigator.

The above is a clinical trial exclusion criterion. Annotated with entity spans:
[Non-query-able: Patients that are considered ineligible for this study by the investigator.]